Clinical trial exclusion criterion:
1. History or presence of allergy to the study drugs or their components or drugs of their class, or a history of drug or other allergy that, in the opinion of the physician responsible, contraindicates their participation

Entity relations:
- AND("allergy", "study drugs")